Clinical trial exclusion criterion:
Clinically positive axillary nodes

Annotated entities:
- Condition: "axillary nodes"
- Qualifier: "positive"